Clinical trial inclusion criterion:
One relapse in the previous year and at least 1 T1 Gadolinium (Gd)+ lesion or 9 or more T2 lesions, while on therapy with other disease modifying drugs (DMDs)

Entity relations:
- Has_temporal("relapse", "in the previous year")
- Has_multiplier("relapse", "One")
- Has_qualifier("lesion", "T1 Gadolinium (Gd)+")
- Has_index("while on therapy", "therapy")
- multi("therapy", "therapy")
- Has_multiplier("T2 lesions", "9 or more")
- Has_multiplier("lesion", "at least 1")
- Has_qualifier("disease modifying drugs (DMDs)", "other")
- Has_temporal("relapse", "while on therapy")
- AND("therapy", "disease modifying drugs (DMDs)")
- Has_temporal("lesion", "while on therapy")
- OR("lesion", "T2 lesions")